Una metodología electroforética muy empleada en la determinación de proteínas es el isoelectroenfoque. En el método habitual:
1. Se genera una zona única de muestra que circula entre dos electrolitos, uno con mayor movilidad que los solutos (trailing) y otro con menor movilidad que cualquiera de ellos (leading).
2. Se añaden modificadores dinámicos a la disolución reguladora con el fin de generar zonas de diferente conductividad.
3. Se realiza la electroforesis en gradientes de pH, de manera que las proteínas se enfocan en zonas bien definidas en los valores de pH que corresponden a cada pI individual.
4. Se utilizan surfactantes micelares aniónicos (CTAB) capaces de interaccionar diferencialmente con las proteínas.

Respuesta correcta: 3. Se realiza la electroforesis en gradientes de pH, de manera que las proteínas se enfocan en zonas bien definidas en los valores de pH que corresponden a cada pI individual.